Clinical trial exclusion criterion:
Evidence of severe symptomatic heart failure (NYHA Class III or IV)

Annotated entities:
- Qualifier: "severe"
- Qualifier: "symptomatic"
- Condition: "heart failure"
- Measurement: "NYHA"
- Value: "Class III or IV"